Are male or female persons more prone to autoimmunity?

females